Clinical trial exclusion criterion:
Inability to adhere to protocol.

Annotated entities:
- Post-eligibility: "Inability to adhere to protocol"